Known history of angioedema.

The above is a clinical trial exclusion criterion. Annotated with entity spans:
Known [Temporal: history] of [Condition: angioedema].